Clinical trial inclusion criterion:
Stool examination for enteric pathogens including Clostridium difficile

Annotated entities:
- Procedure: "Stool examination"
- Qualifier: "for enteric pathogens including Clostridium difficile"